Clinical trial exclusion criterion:
Wound healing issues at time of possible conversion (eg, wound dehiscence, wound infection, incisional hernia, lymphocele, seroma)

Entity relations:
- Has_temporal("Wound healing issues", "at time of possible conversion")
- AND("Wound healing issues", "wound dehiscence")
- OR("wound dehiscence", "wound infection", "incisional hernia", "lymphocele", "seroma")